Coagulation disorder defined by PT less than 60%

The above is a clinical trial inclusion criterion. Annotated with entity spans:
[Condition: Coagulation disorder] defined by [Measurement: PT] [Value: less than 60%]